Be willing to attend all clinic visits

The above is a clinical trial inclusion criterion. Annotated with entity spans:
[Non-query-able: Be willing to attend all clinic visits]